胸腺中，那一種細胞可表現主要組織抗原（MHC）以促進正選擇（positive selection）？
A. 皮質表皮細胞（cortical epithelial cell）
B. 髓質表皮細胞（medullary epithelial cell）
C. 巨噬細胞（macrophage）
D. 樹突細胞（dendritic cell）

正確答案：A. 皮質表皮細胞（cortical epithelial cell）